A las 10 de la mañana de analiza una muestra de suero y se obtiene una concentración de bilirrubina total de 12 mg/dL (205,6 µmol/L). La misma muestra se vuelve a analizar a las 3 de la tarde y el resultado de la bilirrubina es 8 mg/dL (136,8 µmol/L). Indique cuál es la explicación más razonable que justifique esta discrepancia:
1. Deterioro del reactivo.
2. Muestra expuesta a la luz.
3. Error de cálculo en el primer análisis.
4. Muestra no refrigerada.

Respuesta correcta: 2. Muestra expuesta a la luz.